Clinical trial exclusion criterion:
Patients undergoing total hip or knee replacement who have been enrolled in this study for a prior hip or knee replacement;

Annotated entities:
- Procedure: "total knee replacement"
- Procedure: "total hip replacement"
- Competing_trial: "atients undergoing total hip or knee replacement who have been enrolled in this study for a prior hip or knee replacement;"